Clinical trial exclusion criterion:
Coagulopathy;

Annotated entities:
- Condition: "Coagulopathy"